Clinical trial inclusion criterion:
stable metabolic status

Annotated entities:
- Measurement: "metabolic status"
- Qualifier: "stable"